What is the effect of the direct interaction of Ikaros and Foxp1 in B-lymphocytes?

Direct interaction of Ikaros and Foxp1 modulates expression of the G protein-coupled receptor G2A in B-lymphocytes and acute lymphoblastic leukemia.